Clinical trial exclusion criterion:
Patients unwilling to limit exposure to UV light

Entity relations:
- Has_mood("limit exposure to UV light", "unwilling")